Dentro de las funciones de atención directa desarrolladas por los Equipos de Atención Primaria NO se encuentra:
1. Promoción de los estilos de vida saludables.
2. Prevención secundaria de problemas más prevalentes en la comunidad.
3. Elaboración e implementación de proyectos de educación para la salud en los entornos escolares.
4. Formación pregrado y postgrado del personal de salud.
5. Rehabilitación.

Respuesta correcta: 4. Formación pregrado y postgrado del personal de salud.